Clinical trial inclusion criterion:
Able to ambulate a few steps with or without an assistive device

Entity relations:
- Has_qualifier("Able to ambulate a few steps", "with assistive device")
- OR("with assistive device", "without an assistive device")